Clinical trial inclusion criterion:
Hemoglobin: ≥ 9 g/dL

Annotated entities:
- Measurement: "Hemoglobin"
- Value: "≥ 9 g/dL"